對於心電圖心軸偏左（left axis deviation）的可能原因，何者錯誤？
A. 左右手導程顛倒（reversal of the left and right arm electrodes）
B. 可見於正常人（normal variant）
C. 左心室肥厚（left ventricular hypertrophy）
D. 下壁心肌梗塞（inferior myocardial infarction）

正確答案：A. 左右手導程顛倒（reversal of the left and right arm electrodes）